¿En cuál de las siguientes fobias resulta más difícil programar el tratamiento de exposición en vivo por el carácter variable e impredecible de las situaciones?:
1. La fobia a la sangre.
2. La agorafobia.
3. La fobia social.
4. La fobia a la oscuridad.

Respuesta correcta: 3. La fobia social.